Clinical trial inclusion criterion:
Living, singleton fetus

Annotated entities:
- Condition: "singleton fetus"
- Qualifier: "Living"